Clinical trial inclusion criterion:
Must be currently smoking at least ½ pack/day at baseline (confirmed with cotinine level and CO Smokerlyzer

Entity relations:
- Has_value("pack/day", "at least ½")
- AND("smoking", "pack/day")
- Has_temporal("smoking", "at baseline")
- AND("smoking", "cotinine level")
- AND("smoking", "CO Smokerlyzer")